Tetracycline treatment within two weeks

The above is a clinical trial exclusion criterion. Annotated with entity spans:
[Drug: Tetracycline] treatment [Temporal: within two weeks]